Señale en qué situación clínica NO indicaría interferón beta de inicio en un paciente diagnosticado de esclerosis múltiple:
1. Múltiples brotes recurrentes.
2. Mala respuesta a los corticoides en los brotes.
3. Haber padecido un solo brote de la enfermedad con secuelas.
4. Tener más de 50 años.
5. Una forma clínica primaria progresiva.

Respuesta correcta: 5. Una forma clínica primaria progresiva.